有關先天性免疫力（innate immunity）之概念，下列何者錯誤？
A. 在微生物入侵數分鐘內即可啟動其反應
B. 對微生物進行吞噬作用
C. 對微生物不具備辨識能力
D. 可由細胞外病原（extracellular pathogens）以及細胞內病原（intracellular pathogens）引

正確答案：C. 對微生物不具備辨識能力